Clinical trial exclusion criteria:
pregnancy
known allergies for tranexamic acid or any other substance in Exacyl
deep vein thrombosis
Hormone Replacement Therapy or oral contraceptive usage
anticoagulants usage
obesity - BMI (body mass index) >30 kg/m2
renal disease, as glomerular filtration rate (GFR) <60 ml/min/1,73 m*m
seizures or epilepsy in the past

Annotated entities:
- Condition: "pregnancy"
- Condition: "allergies"
- Drug: "tranexamic acid"
- Drug: "Exacyl"
- Condition: "deep vein thrombosis"
- Procedure: "Hormone Replacement Therapy"
- Drug: "oral contraceptive"
- Drug: "anticoagulants"
- Condition: "obesity"
- Measurement: "BMI"
- Measurement: "body mass index"
- Value: ">30 kg/m2"
- Condition: "renal disease"
- Measurement: "glomerular filtration rate"
- Measurement: "GFR"
- Value: "<60 ml/min/1,73 m*m"
- Value: "seizures"
- Value: "epilepsy"
- Temporal: "in the past"